Clinical trial inclusion criterion:
Written informed consent obtained from the subject or subject's legal representative

Annotated entities:
- Observation: "Written informed consent"
- Qualifier: "from the subject"
- Qualifier: "from the subject's legal representative"